MLA(minimal luminal area)<4mm2

The above is a clinical trial inclusion criterion. Annotated with entity spans:
[Measurement: MLA]([Measurement: minimal luminal area])[Value: <4mm2]